Clinical trial exclusion criterion:
ALL as secondary malignancy

Annotated entities:
- Condition: "ALL"
- Qualifier: "secondary"
- Condition: "malignancy"